Clinical trial exclusion criterion:
Prior treatment for wet AMD

Annotated entities:
- Temporal: "Prior"
- Procedure: "treatment"